有關妊娠滋養層細胞疾病（gestational trophoblastic disease）的敘述，下列何者正確?
A. 發生率為每 10000 次正常懷孕中有一個發生
B. 患者的 beta-hCG 值通常比預期中還低
C. 部分性葡萄胎（partial mole）多為三套染色體，在治療過後常有惡性變化
D. 完全性葡萄胎（complete mole）多為雙套染色體，所有染色體皆來自父系

正確答案：D. 完全性葡萄胎（complete mole）多為雙套染色體，所有染色體皆來自父系